若此檢查結果為侵襲性鱗狀細胞癌（invasive squamous cell carcinoma），基質侵襲深度為 10 mm，泌尿道攝影（IVP）有左側腎水腫，膀胱鏡檢查正常。則病人該接受何種治療？
A. 子宮頸圓錐 	切片
B. 子宮頸癌根除術
C. 化學治療
D. 放射線治 	療合併化學治療（concurrent chemoradiation）

正確答案：D. 放射線治 	療合併化學治療（concurrent chemoradiation）